Clinical trial inclusion criterion:
Patients deemed as resectable by pancreatic protocol CT or MRI

Entity relations:
- AND("pancreatic protocol CT", "deemed as resectable")
- OR("pancreatic protocol CT", "pancreatic protocol MRI")